去氧核糖核酸（DNA）雙股螺旋（double helix）結構為二十世紀最偉大的發現之一。雙股螺旋結構之穩定性主要來自下列何者？
A. 鄰近嘌呤（purine）間之氫鍵
B. 鄰近嘧啶（pyrimidine）間之氫鍵
C. 雙股螺旋結構本身
D. 不同股 DNA 嘌呤（purine）與嘧啶（pyrimidine）間之氫鍵

正確答案：D. 不同股 DNA 嘌呤（purine）與嘧啶（pyrimidine）間之氫鍵